Lumbar puncture within the previous two weeks

The above is a clinical trial exclusion criterion. Annotated with entity spans:
[Procedure: Lumbar puncture] [Temporal: within the previous two weeks]